李小弟是嚴重性 A 型血友病患，經常關節內出血，下列敘述何者正確？
A. 此病是第九凝血因子缺少
B. 此病人的內因性凝血途徑（intrinsic pathway）發生異常
C. 此病之血小板功能異常
D. 此病血小板數目降低，導致出血傾向

正確答案：B. 此病人的內因性凝血途徑（intrinsic pathway）發生異常